Patients cannot begin psychotherapy during the study period, but may continue if started prior to the study.

The above is a clinical trial exclusion criterion. Annotated with entity spans:
[Non-representable: Patients cannot begin psychotherapy during the study period, but may continue if started prior to the study].